深夜手術室送來了一個 27 歲車禍，須緊急進行開顱術減壓的病人，麻醉時採取 hyperventilation 來降低顱內壓（intracranial pressure），下列有關敘述，何者正確？①hyperventilation 會使腦脊髓液偏向酸性 ②即使持續 hyperventilation，腦血流量（cerebral blood flow）會在約 12 小時之後慢慢回到原本的數值 ③過度的 hyperventilation，如使 PaCO2低於 20 mmHg，也可能造成受傷的腦部缺血（ischemia） ④如果腦部腫脹非常嚴重，應考慮開刀後暫時不關閉顱骨
A. ①②③
B. ②③④
C. 僅①④
D. 僅③④

正確答案：B. ②③④